Patients of ASA status I - III

The above is a clinical trial inclusion criterion. Annotated with entity spans:
Patients of [Measurement: ASA status] [Value: I - III]